El calentamiento de trans, cis, trans-2,4,6octatrieno da lugar a:
1. trans, trans, trans-2,4,6-Octatrieno.
2. cis, cis, cis-2,4,6-Octatrieno.
3. No hay reacción.
4. trans-5,6-Dimetil-1,3-ciclohexadieno.
5. cis-5,6-Dimetil-1,3-ciclohexadieno.

Respuesta correcta: 5. cis-5,6-Dimetil-1,3-ciclohexadieno.